Chronic use of opioid and sedatives

The above is a clinical trial exclusion criterion. Annotated with entity spans:
[Multiplier: Chronic use] of [Drug: opioid] and [Drug: sedatives]